Which is the clinical meaning of the presence of delayed enhancement in patients with hypertrophic cardiomyopathy?

Occurrence of myocardial fibrosis in hypertrophic cardiomyopathy is associated with left atrial and ventricular dysfunction as well as with the severity of heart failure symptoms and arrhythmic risk factors.